Clinical trial exclusion criterion:
Acute heart failure or during episodes of heart failure decompensation requiring intravenous inotropic therapy.

Annotated entities:
- Condition: "Acute heart failure"
- Condition: "heart failure decompensation"
- Procedure: "intravenous inotropic therapy"